有關methimazole的藥理作用，下列何者錯誤？
A. 主要透過抑制甲狀腺過氧化物酶催化反應（thyroid peroxidase-catalytic reaction）及碘有機化（iodine organification）的作用，來抑制甲狀腺素（triiodothyronine及tetraiodothyronine）的合成
B. 會抑制週邊組織，將triiodothyronine及tetraiodothyronine進行脫碘化作用（deiodination）
C. 其藥效起始作用（onset）相當快速，通常在服藥後即可產生治療效果
D. 使用最常產生的副作用是斑丘疹搔癢皮疹（maculopapular pruritic rash）

正確答案：C. 其藥效起始作用（onset）相當快速，通常在服藥後即可產生治療效果